What is the functional role of the protein Drp1?

Drp1 is involved in the regulation of mitochondrial fission.